下列何種藥物最不適合用於預防「運動引起的氣管痙攣（EIB）」？
A. Cromolyn
B. Terbutaline
C. Salmeterol
D. Theophylline

正確答案：D. Theophylline